Clinical trial exclusion criterion:
Uremia patients or Creatinine = 2 mg/dl.

Annotated entities:
- Condition: "Uremia"
- Measurement: "Creatinine"
- Value: "= 2 mg/dl"